Clinical trial inclusion criterion:
living at home in the community;

Annotated entities:
- Observation: "living at home in the community"